Clinical trial inclusion criteria:
ASA 1
ASA 2
Pts have current treatment plan at OHSU for extraction of some or all of remaining teeth and scheduled for delivery of a removable appliance post extraction
Teeth used are able to be isolated with rubber dam
Understand and sign consent form

Annotated entities:
- Condition: "ASA 1"
- Condition: "ASA 2"
- Mood: "treatment plan at OHSU"
- Mood: "scheduled for"
- Non-representable: "Pts have current treatment plan at OHSU for extraction of some or all of remaining teeth and scheduled for delivery of a removable appliance post extraction"
- Non-representable: "Teeth used are able to be isolated with rubber dam"
- Post-eligibility: "Understand and sign consent form"